李醫師是在一個小鎮執業數十年的醫師，很多居民是由他所接生，幫忙處理居民從小到大的健康問題。李醫師的服務符合基層醫療保健的那一個特性？
A. 負責性（accountability）
B. 持續性（continuity）
C. 周全性（comprehensiveness）
D. 協調性（coordination）

正確答案：B. 持續性（continuity）